Clinical trial inclusion criterion:
Age = 65 years with one additional stroke risk factor (hypertension, diabetes, heart failure history of or left ventricular ejection fraction <0.40), previous stroke or transient ischemic attack).

Annotated entities:
- Person: "Age"
- Value: "= 65 years"
- Multiplier: "one additional"
- Condition: "risk factor"
- Condition: "stroke"
- Condition: "hypertension"
- Condition: "diabetes"
- Condition: "heart failure"
- Measurement: "left ventricular ejection fraction"
- Value: "<0.40"
- Temporal: "history"
- Temporal: "previous"
- Condition: "stroke"
- Condition: "transient ischemic attack"